正常懷孕36週內之性生活是：
A. 妊娠第一個月禁慾
B. 妊娠最後八週不要有任何性行為
C. 妊娠中期後不要有任何性行為
D. 沒有特殊限制

正確答案：D. 沒有特殊限制